Clinical trial exclusion criteria:
Patients minors
Patients on a legal protection regime type guardianship
Respiratory pathologies, cardiovascular, renal, diabetes
Claustrophobia
Contraindications to exposure to a magnetic field
Contraindications to injecting Dotarem ®

Annotated entities:
- Person: "minors"
- Person: "legal protection regime type guardianship"
- Condition: "Respiratory pathologies"
- Condition: "cardiovascular"
- Condition: "renal"
- Condition: "diabetes"
- Condition: "Claustrophobia"
- Condition: "Contraindications"
- Device: "magnetic field"
- Condition: "Contraindications"
- Drug: "Dotarem"